Clinical trial exclusion criterion:
Significant change in diet or level of physical activity within 1 month before dosing or change in weight of more than 5 kg within 3 months before Screening

Annotated entities:
- Observation: "change in diet"
- Qualifier: "Significant"
- Observation: "change in level of physical activity"
- Temporal: "within 1 month before dosing"
- Reference_point: "dosing"
- Observation: "change in weight"
- Value: "more than 5 kg"
- Temporal: "within 3 months before Screening"
- Reference_point: "Screening"